En el ciclo de la urea, el argininsuccinato:
1. Genera fumarato y arginina por la argininsuccinasa.
2. Tiene cinco grupos amino en su estructura.
3. Su síntesis produce energía en forma de ATP.
4. Se sintetiza en la mitocondria.
5. Es un cetoácido.

Respuesta correcta: 1. Genera fumarato y arginina por la argininsuccinasa.